Which markers are screened with the triple test for the detection of syndromes in fetus?

The markers that are screened with the triple test for the detection of syndromes in fetus are:
1) alpha-fetoprotein (AFP), 
2) beta-chorionic gonadotrophin (beta-CG) and 
3) unconjugated oestriol (uE3).